Clinical trial inclusion criterion:
BMI > 18,5 <30 kg/m2

Annotated entities:
- Measurement: "BMI"
- Value: "> 18,5 <30 kg/m2"